Clinical trial inclusion criterion:
cephalic presentation

Annotated entities:
- Condition: "cephalic presentation"